the presence of concurrent infection or inflammation

The above is a clinical trial exclusion criterion. Annotated with entity spans:
the presence of [Temporal: concurrent] [Condition: infection] or [Condition: inflammation]